Clinical trial exclusion criterion:
Brain trauma or neurosurgery;

Annotated entities:
- Condition: "Brain trauma"
- Procedure: "neurosurgery"